Pregnant and lactating women

The above is a clinical trial exclusion criterion. Annotated with entity spans:
[Condition: Pregnant] and [Condition: lactating] [Person: women]